Type 2 diabetic patients

The above is a clinical trial inclusion criterion. Annotated with entity spans:
[Condition: Type 2 diabetic] patients